Anemia (hemoglobin < 9 mg/dl) or thrombocytopenia (Platelet count <75), or thrombocytosis (Platelet count >600)

The above is a clinical trial exclusion criterion. Annotated with entity spans:
[Condition: Anemia] ([Measurement: hemoglobin] [Value: < 9 mg/dl]) or [Condition: thrombocytopenia] ([Measurement: Platelet count] [Value: <75]), or [Condition: thrombocytosis] ([Measurement: Platelet count] [Value: >600])